4個月大的嬰兒，因為點頭式痙攣（infantile spasms）就診。身體診察發現皮膚上有葉狀脫色白斑（ash-leaf hypomelanosis），腦電波圖檢查有亂棘波（hypsarrhythmia）。最可能的診斷為何？
A. 神經纖維瘤（neurofibromatosis）
B. 結節性硬化症（tuberous sclerosis）
C. Sturge-Weber症候群
D. 色素失調症（incontinentia pigmenti）

正確答案：B. 結節性硬化症（tuberous sclerosis）